Clinical trial exclusion criterion:
Participation in another clinical trial within 30 days prior to baseline visit.

Annotated entities:
- Non-query-able: "Participation in another clinical trial within 30 days prior to baseline visit."
- Context_Error: "Participation in another clinical trial within 30 days prior to baseline visit."